Clinical trial exclusion criterion:
Hepatitis B surface antigen positive

Entity relations:
- Has_value("Hepatitis B surface antigen", "positive")